Clinical trial exclusion criterion:
history of severe chronic diseases

Annotated entities:
- Qualifier: "severe"
- Condition: "chronic diseases"
- Temporal: "history"